下列那一種胺基酸最有可能在蛋白質結構中參與順式胜肽鍵（cis peptide bond）的形成？
A. 組胺酸（histidine）
B. 丙胺酸（alanine）
C. 脯胺酸（proline）
D. 甘胺酸（glycine）

正確答案：C. 脯胺酸（proline）